Pregnancy or nursing.

The above is a clinical trial exclusion criterion. Annotated with entity spans:
[Condition: Pregnancy] or [Condition: nursing].